The presence of respiratory, cardio-vascular insufficiency, impaired liver and kidney function, established during a physical examination at visit number 1;

The above is a clinical trial exclusion criterion. Annotated with entity spans:
The presence of [Condition: respiratory], [Condition: cardio-vascular insufficiency], [Condition: impaired liver] and kidney function, established during a physical examination [Temporal: at visit number 1];